List the 5 different human immunoglobulin heavy chains.

The 5 human immunoglobulin heavy chains are Alpha, Delta Epsilon, Gamma and Mu